Clinical trial exclusion criterion:
Hypersensitivity to the active substance, or to any of the excipients of Lemtrada®

Entity relations:
- AND("Hypersensitivity", "Lemtrada")